Which residue of alpha-synuclein was found to be phosphorylated in Lewy bodies?

Alpha-synuclein is phosphorylated at serine 129 (Ser129) in intracellular protein aggregates called Lewy bodies, which are characteristic pathologic lesions of Parkinson disease.